Clinical trial exclusion criterion:
Epilepsy.

Annotated entities:
- Condition: "Epilepsy"